With severe cardiovascular disease, or mental

The above is a clinical trial exclusion criterion. Annotated with entity spans:
With [Qualifier: severe] [Condition: cardiovascular disease], or mental